Clinical trial exclusion criterion:
Wilson's disease

Annotated entities:
- Condition: "Wilson's disease"